De los siguientes marcadores de superficie, uno de ellos se expresa sólo en los linfocitos T vírgenes, mientras que los restantes se encuentran también en la población de linfocitos T activados. ¿Cuál es?
1. La molécula de adhesión L-selectina.
2. El receptor de linfocitos T (TCR).
3. La integrina LFA-1.
4. La molécula correceptora CD4.
5. La integrina VLA-4.

Respuesta correcta: 1. La molécula de adhesión L-selectina.